Age 35-70 years old

The above is a clinical trial inclusion criterion. Annotated with entity spans:
[Person: Age] [Value: 35-70 years old]